Clinical trial exclusion criterion:
uncontrolled asthma, or

Entity relations:
- Has_qualifier("asthma", "uncontrolled")